Clinical trial inclusion criterion:
Has elevated CRP at Screening or evidence of active inflammation in the sacroiliac joints on MRI

Annotated entities:
- Measurement: "CRP"
- Value: "elevated"
- Temporal: "at Screening"
- Qualifier: "active"
- Condition: "inflammation"
- Qualifier: "sacroiliac joints"
- Procedure: "MRI"